Clinical trial inclusion criterion:
4. Patients with CRPS must have met current IASP (International Association for the Study of Pain) diagnostic criteria

Annotated entities:
- Condition: "CRPS"
- Measurement: "IASP (International Association for the Study of Pain) diagnostic criteria"
- Value: "met"